oxycodone contraindicated

The above is a clinical trial exclusion criterion. Annotated with entity spans:
[Drug: oxycodone] [Condition: contraindicated]